Which is the "bonding hormone"?

Oxytocin is known as the 'bonding hormone' due its role in promoting mother-child and pair bonding.